¿Cuál NO es una manifestación clínica de un niño moribundo?:
1. Cambios en el color de la piel.
2. Disminución del volumen de los ruidos de Korotkoff.
3. Respiración Kussmaul.
4. Agitación.

Respuesta correcta: 3. Respiración Kussmaul.